Joint anatomy is identifiable using ultrasonography

The above is a clinical trial inclusion criterion. Annotated with entity spans:
[Non-representable: Joint anatomy is identifiable using ultrasonography]